Clinical trial exclusion criterion:
Pregnant or childbearing potential women or breastfeeding women

Entity relations:
- OR("Pregnant", "breastfeeding", "childbearing potential")